Subject or legal representative has voluntarily signed the informed consent approved by the Institutional Review Board,

The above is a clinical trial inclusion criterion. Annotated with entity spans:
[Informed_consent: Subject or legal representative has voluntarily signed the informed consent approved by the Institutional Review Board,]